Clinical trial exclusion criterion:
Has received ECT or MECT within 3 months prior to screening.

Entity relations:
- Has_index("within 3 months prior to screening", "screening")
- Has_temporal("ECT", "within 3 months prior to screening")
- OR("ECT", "MECT")